Clinical trial inclusion criterion:
Subject's ability to lay in a supine position with their hands at their sides during CVP measurements

Annotated entities:
- Observation: "ability to lay in a supine position with their hands at their sides"
- Temporal: "during CVP measurements"
- Procedure: "CVP measurements"
- Reference_point: "CVP measurements"